Clinical trial inclusion criterion:
Willing to strictly follow the study protocol;

Annotated entities:
- Non-query-able: "Willing to strictly follow the study protocol;"
- Post-eligibility: "Willing to strictly follow the study protocol;"